Clinical trial inclusion criterion:
Current substance/alcohol use disorder on structured interview (MINI Plus) Page 21 of 39 Commercial-in-Confidence

Entity relations:
- Subsumes("structured interview", "MINI Plus")
- AND("structured interview", "substance use disorder")
- OR("substance use disorder", "alcohol use disorder")